Clinical trial inclusion criterion:
Reference vessel size 2.5 mm by visual estimation

Entity relations:
- Has_value("Reference vessel size by visual estimation", "2.5 mm")